45 歲男性製麵師傅主訴右手掌、第一、二、三指及一部份第四指刺痛，症狀在夜間加劇，神經傳導檢查時下列何神經最可能不正常？
A. Radial nerve
B. Median nerve
C. Ulnar nerve
D. Axillary nerve

正確答案：B. Median nerve